=19 years of age

The above is a clinical trial inclusion criterion. Annotated with entity spans:
[Value: =19 years] of [Person: age]